Clinical trial exclusion criterion:
Currently prescribed a phosphodiesterase (PDE) inhibitors medication (ex: Viagra, Cialis, etc)

Entity relations:
- Subsumes("phosphodiesterase (PDE) inhibitors", "Viagra")
- OR("Viagra", "Cialis")